Subjects referred to diagnostic or therapeutic colonoscopy.

The above is a clinical trial inclusion criterion. Annotated with entity spans:
Subjects referred to [Observation: diagnostic] or [Observation: therapeutic] [Procedure: colonoscopy].